¿Cuál de los siguientes cambios genéticos es capaz de modificar la región variable del alelo que codifica para la cadena ligera de una inmunoglobulina después de que el linfocito B que la expresa reconozca un antígeno en un ganglio linfático?
1. Recombinación somática.
2. Diversidad de unión por adición de nucleótidos N (no codificados).
3. Hipermutación somática.
4. Diversidad de unión por adición de nucleóticos P (palindrómicos).

Respuesta correcta: 3. Hipermutación somática.